List symptoms of 4H leukodystrophy.

Hypomyelination, hypodontia, and hypogonadotropic hypogonadism are major symptoms of 4H leukodystrophy.